Excessive alcohol consumption

The above is a clinical trial exclusion criterion. Annotated with entity spans:
[Condition: Excessive alcohol consumption]